Clinical trial inclusion criterion:
Eligible for surgery with curative intent

Annotated entities:
- Procedure: "surgery"
- Qualifier: "curative"